Known fetal anomaly

The above is a clinical trial exclusion criterion. Annotated with entity spans:
Known [Condition: fetal anomaly]